QTc interval over 450 msec or risk factors for torsades de pointes or on Class IA and Class III anti arrhythmic medications

The above is a clinical trial exclusion criterion. Annotated with entity spans:
[Measurement: QTc interval] [Value: over 450 msec] or [Observation: risk factors for torsades de pointes] or on [Drug: Class IA] and [Drug: Class III anti arrhythmic medications]